一位 7 歲男童右頸部明顯腫脹且有發燒現象，根據下列那一個特徵可判斷該腫脹為頸部淋巴腺腫大而非腮腺腫大？
A. 腫脹位置完全位於下頜骨下方
B. 腫脹部位有明顯壓痛
C. 雙側腫脹
D. 觸壓腫脹部位時，可於唾液管出口看到膿液流出

正確答案：A. 腫脹位置完全位於下頜骨下方